Known hypersensitivity to any of the components of the solution

The above is a clinical trial exclusion criterion. Annotated with entity spans:
[Non-representable: Known hypersensitivity to any of the components of the solution]